Clinical trial exclusion criterion:
Protocol-determined chemotherapy hydration

Annotated entities:
- Qualifier: "Protocol-determined"
- Procedure: "chemotherapy hydration"